absence of affiliation to social security

The above is a clinical trial exclusion criterion. Annotated with entity spans:
[Negation: absence] of [Observation: affiliation to social security]